Clinical trial exclusion criteria:
allergy to morphine or ketamine
contraindicate to ketamine
remain intubated in the postoperative period

Annotated entities:
- Condition: "allergy"
- Drug: "morphine"
- Drug: "ketamine"
- Condition: "contraindicate"
- Drug: "ketamine"
- Condition: "intubated"
- Temporal: "in the postoperative period"
- Reference_point: "postoperative period"
- Procedure: "intubated"